Clinical trial inclusion criteria:
Elective Cardiac surgery
American Society of Anesthesiologists physical status class I-III

Annotated entities:
- Device: "Elective Cardiac surgery"
- Measurement: "American Society of Anesthesiologists physical status"
- Value: "class I-III"